Clinical trial inclusion criterion:
Clinical and radiologic diagnosis of primary knee osteoarthritis (Kellgren & Lawrence I, II or III);

Annotated entities:
- Condition: "primary knee osteoarthritis"
- Measurement: "Kellgren & Lawrence"
- Value: "I, II or III"
- Qualifier: "Clinical diagnosis"
- Qualifier: "radiologic diagnosis"